Clinical trial exclusion criterion:
3. Known cirrhosis, or >6 standard alcoholic drinks/day

Entity relations:
- OR("cirrhosis", ">6 standard alcoholic drinks/day")